Clinical trial exclusion criterion:
pregnant

Annotated entities:
- Condition: "pregnant"